Clinical trial inclusion criterion:
Be healthy on the basis of clinical laboratory tests performed at Screening. If the results of the serum chemistry panel [including liver enzymes], hematology, or urinalysis are outside the normal reference ranges, the participant may be included only if the investigator judges the abnormalities or deviations from normal to be not clinically significant. This determination must be recorded in the participants' source documents and initialed by the investigator

Entity relations:
- Has_index("performed at Screening", "at Screening")
- Has_temporal("clinical laboratory tests", "performed at Screening")
- AND("healthy", "clinical laboratory tests")
- Has_value("serum chemistry panel", "outside the normal reference range")
- OR("serum chemistry panel", "hematology", "liver enzymes", "urinalysis")